在婦科癌病化療藥物中，下列何種化學藥物不屬於生物鹼（plant alkaloids）？
A. vincristine
B. gemcitabine
C. etoposide
D. paclitaxel

正確答案：B. gemcitabine